Clinical trial inclusion criterion:
At least two of the following additional criteria

Annotated entities:
- Multiplier: "At least two"
- Non-representable: "At least two of the following additional criteria"